High risk for HIV infection

The above is a clinical trial inclusion criterion. Annotated with entity spans:
[Mood: High risk for] [Condition: HIV infection]